下列關於癲癇症病因的敘述，何者正確？
A. 小於 1 個月新生兒以腦部腫瘤最常見
B. 嬰幼兒及少年（大於 1 個月，小於 12 歲）以基因異常或原發性（idiopathic）為主
C. 青少年（12 至 18 歲）以腦血管疾病為主
D. 青年與成人（18 至 35 歲）以神經退化性疾病為主

正確答案：B. 嬰幼兒及少年（大於 1 個月，小於 12 歲）以基因異常或原發性（idiopathic）為主